一位 57 歲男性鼻咽癌末期病人，因呼吸困難、疼痛及進食困難，而入住安寧病房，有關癌症末期病人的營養（nutrition）問題，下列敘述何者錯誤？
A. 末期病人因進食困難而吃的少是家屬常關心之問題
B. 接受插入鼻胃管灌食之末期病人，會有自拔鼻胃管及造成吸入性肺炎的機會
C. 目前並沒有證據顯示強迫進食可以延長末期病人生命
D. 對於吃的少的末期病人，應該積極強調全靜脈營養補充（total parenteral nutrition）的重要性

正確答案：D. 對於吃的少的末期病人，應該積極強調全靜脈營養補充（total parenteral nutrition）的重要性